Screening stool study positive for enteric pathogens or Clostridium difficile toxin.

The above is a clinical trial exclusion criterion. Annotated with entity spans:
Screening [Procedure: stool study] [Value: positive] for [Qualifier: enteric pathogens] or [Qualifier: Clostridium difficile toxin].